glaucoma

The above is a clinical trial exclusion criterion. Annotated with entity spans:
[Condition: glaucoma]